變異型庫賈氏病（variant Creutzfeldt-Jakob disease, vCJD）和散發型庫賈氏病（sporadic Creutzfeldt-Jakob disease, sCJD）的差異，下列敘述何者錯誤？
A. vCJD的病程比sCJD較為緩慢
B. vCJD的病人臨床上較少出現肌躍症（myoclonic jerk）
C. vCJD病人腦脊液14-3-3蛋白上升的比率遠低於sCJD病人
D. vCJD病人腦波出現周期性銳波（periodic synchronous bi- or triphasic sharp wave complexes）的概率遠高於sCJD病人

正確答案：D. vCJD病人腦波出現周期性銳波（periodic synchronous bi- or triphasic sharp wave complexes）的概率遠高於sCJD病人